Moderate to severe CD define as HBI score > 4.

The above is a clinical trial inclusion criterion. Annotated with entity spans:
[Qualifier: Moderate] to [Qualifier: severe] [Condition: CD] define as [Measurement: HBI score] [Value: > 4].